Clinical trial inclusion criterion:
no medical history of cardiovascular and respiratory disease

Annotated entities:
- Negation: "no"
- Temporal: "medical history"
- Condition: "cardiovascular disease"
- Condition: "respiratory disease"